=32 weeks gestational age at birth

The above is a clinical trial inclusion criterion. Annotated with entity spans:
[Value: =32 weeks] [Measurement: gestational age at birth]